一位 75 歲男性由家人陪伴入急診就醫。主訴為 30 分鐘前開始出現突發性腹痛以及冒冷汗（diaphoresis），無嘔吐與腹瀉症狀。病人有末期腎病，規則做血液透析。2 年前曾經心肌梗塞做過心導管以及支架置放。無腹部開刀史。理學檢查發現體溫為 36.8℃，腸音稍慢，無明顯腹部壓痛，肛門檢查正常。心電圖顯示為心房顫動，心跳約 80~120/min，無明顯缺血變化。腹部超音波與 X 光檢查（KUB）皆無發現明顯異常。因病人疼痛難耐經給予多次止痛藥後，腹痛仍無改善。依以上病史與臨床表現，你認為以下何種疾病最有可能？
A. 腸繫膜缺血（mesenteric ischemia）
B. 腸阻塞（intestinal obstruction）
C. 急性膽囊炎（acute cholecystitis）
D. 急性腸胃炎（acute gastroenteritis）

正確答案：A. 腸繫膜缺血（mesenteric ischemia）